La acetilación de las histonas afecta a las trascripción:
1. Bloqueando la incorporación de otros componentes de la maquinaria de transcripción.
2. Impidiendo la remodelación de la cromatina.
3. Facilitando la acción de las helicasas.
4. Disminuyendo la sensibilidad a los receptores nucleares.
5. Reduciendo la afinidad de las histonas por el DNA.

Respuesta correcta: 5. Reduciendo la afinidad de las histonas por el DNA.